M1 (5%) or M2 (= 5% to < 25%) blasts in bone marrow on day 15;

The above is a clinical trial inclusion criterion. Annotated with entity spans:
[Line: M1 (5%) or M2 (= 5% to < 25%) blasts in bone marrow on day 15];